Clinical trial exclusion criterion:
Known other respiratory disorders or signs for other respiratory disorders (e.g. asthma, lung cancer, sarcoidosis, tuberculosis, lung fibrosis, cystic fibrosis, bronchoectasis).

Entity relations:
- Subsumes("respiratory disorders", "asthma")
- OR("asthma", "lung cancer", "sarcoidosis", "tuberculosis", "lung fibrosis", "cystic fibrosis", "bronchoectasis")
- OR("respiratory disorders", "signs for respiratory disorders")